Clinical trial exclusion criterion:
marked brain atrophy as detected by magnetic resonance imaging

Entity relations:
- AND("brain atrophy", "magnetic resonance imaging")